Clinical trial exclusion criterion:
2. Subjects with platinum-refractory disease, defined as disease progression while receiving first line platinum-based therapy.

Entity relations:
- Has_index("while receiving first line platinum-based therapy", "first line platinum-based therapy")
- Has_temporal("disease progression", "while receiving first line platinum-based therapy")
- Subsumes("platinum-refractory disease", "disease progression")